List characteristics of Developmental and Epileptic Encephalopathies (DEEs).

SCN2A-associated developmental and epileptic encephalopathies (DEEs) present with seizures, developmental impairments, and often both.